8. History of Hepatitis B, C, or HIV

The above is a clinical trial exclusion criterion. Annotated with entity spans:
8. [Temporal: History] of [Condition: Hepatitis B], C, or [Condition: HIV]